對於進行婦科大手術的病人，為了防止深部靜脈血栓症（deep vein thrombosis），下列何種處置最佳？
A. elastic stocking
B. low-dose heparin
C. standard-dose heparin
D. external pneumatic leg compression

正確答案：D. external pneumatic leg compression